Clinical trial exclusion criterion:
Varus or valgus misalignment exceeding 15°;

Annotated entities:
- Condition: "valgus misalignment"
- Condition: "Varus misalignment"
- Measurement: "valgus misalignment"
- Measurement: "Varus misalignment"
- Value: "exceeding 15°"